Alcohol or Drug Dependence within 12 months or Abuse within 3 months (excluding nicotine and caffeine) of baseline visit, as assessed by history and urine drug screen.

The above is a clinical trial exclusion criterion. Annotated with entity spans:
[Condition: Alcohol] or [Condition: Drug Dependence] [Temporal: within 12 months] or Abuse [Temporal: within 3 months] (excluding [Drug: nicotine] and [Drug: caffeine]) of baseline visit, as assessed by history and [Measurement: urine drug screen].